Clinical trial inclusion criterion:
known intracranial neoplasm, intracranial arteriovenous malformation or intracranial aneurysm

Annotated entities:
- Condition: "intracranial neoplasm"
- Condition: "intracranial arteriovenous malformation"
- Condition: "intracranial aneurysm"